Performance status 0-2 (Appendix B) may include patients with performance status > 2 attributable to LAL.

The above is a clinical trial inclusion criterion. Annotated with entity spans:
[Measurement: Performance status] [Value: 0-2] [Non-representable: (Appendix B) may include patients with performance status > 2 attributable to LAL].